Clinical trial inclusion criterion:
Lack of land autoimmune (no history of thyroid disease or diabetes type 1)

Annotated entities:
- Condition: "autoimmune"
- Condition: "thyroid disease"
- Condition: "diabetes type 1"
- Negation: "no"
- Temporal: "history"
- Grammar_Error: "Lack of land"